精細觸覺主要由下列何種神經徑路傳導？
A. 脊髓網狀徑（spinoreticular tract）
B. 背側脊髓小腦徑（dorsal spinocerebellar tract）
C. 背柱內側蹄系（dorsal column-medial lemniscus system）
D. 前外側系統（anterolateral system）

正確答案：C. 背柱內側蹄系（dorsal column-medial lemniscus system）